Protein phosphatase 可拮抗下列那類酵素的反應結果？
A. acetyltransferases
B. methyltransferases
C. ubiquitin E3 ligases
D. kinases

正確答案：D. kinases